inability to tolerate small, enclosed spaces without anxiety (e.g. claustrophobia), as determined by self-report and/or a preliminary session in a mock scanner

The above is a clinical trial exclusion criterion. Annotated with entity spans:
[Mood: inability] to [Condition: tolerate small, enclosed spaces without anxiety] (e.g. [Condition: claustrophobia]), as determined by [Procedure: self-report] and/or a preliminary session in a mock scanner